Patients with pre-treatment with steroid injections/or local anesthetics.

The above is a clinical trial exclusion criterion. Annotated with entity spans:
Patients with pre-treatment with [Procedure: steroid injections]/or [Procedure: local anesthetics].